Clinical trial inclusion criteria:
Primary periampullary tumor
R0, R1 resection
Chronic pancreatitis requiring pancreatoduodenectomy

Annotated entities:
- Qualifier: "Primary"
- Condition: "periampullary tumor"
- Procedure: "R1 resection"
- Procedure: "R0 resection"
- Condition: "Chronic pancreatitis"
- Observation: "requiring"
- Procedure: "pancreatoduodenectomy"